Clinical trial exclusion criterion:
Presence or recent history of major depressive disorder, bipolar disorder, psychotic disorder, or generalized anxiety disorder requiring therapy.

Entity relations:
- Has_temporal("major depressive disorder", "history")
- Has_qualifier("major depressive disorder", "requiring therapy")
- OR("major depressive disorder", "bipolar disorder", "psychotic disorder", "generalized anxiety disorder")